What is the purpose of the Barricaid annular closure device?

Barricaid annular closure device can improve outcome after lumbar discectomy by reducing the risk of recurrent disc herniation of the same level.